下列關於營養不良型（dystrophic type）神經纖維瘤脊椎側彎的敘述，何者錯誤？
A. 經常是短的，急性彎曲的側彎
B. 背架的治療效果佳
C. 經常合併駝背變形
D. 是遺傳性疾病

正確答案：B. 背架的治療效果佳